Clinical trial exclusion criterion:
Prior surgery at the index lumbar level.

Entity relations:
- Has_temporal("surgery", "Prior")
- Has_qualifier("surgery", "index lumbar level")